a. History of any significant chronic disease and/or hepatitis. b. History of drug and/or alcohol abuse. c. Acute illness at the time of either the prestudy medical evaluation or dosing.

The above is a clinical trial exclusion criterion. Annotated with entity spans:
[Parsing_Error: a.] [Temporal: History] of any [Qualifier: significant] [Condition: chronic disease] and/or [Condition: hepatitis]. [Parsing_Error: b.] [Temporal: History] of [Condition: drug] and/or [Condition: alcohol abuse]. [Parsing_Error: c.] [Undefined_semantics: Acute illness at the time of either the prestudy medical evaluation or dosing.]